病患舌頭吐出時，偏向左方，下列何者最可能受傷？
A. 右側第九顱神經
B. 右側頦舌肌（genioglossus）
C. 左側第十二顱神經
D. 左側第五顱神經第三分支

正確答案：C. 左側第十二顱神經